Clinical trial inclusion criterion:
3) major depressive disorder (PHQ-9 > 10) and diagnosed using the Structured Clinical Interview for Depression (SCID) according to the Diagnostic and Statistical Manual of Mental Disorders, Fourth Edition (DSM-IV),

Annotated entities:
- Condition: "major depressive disorder"
- Measurement: "PHQ-9"
- Value: "> 10"
- Procedure: "Structured Clinical Interview for Depression (SCID) according to the Diagnostic and Statistical Manual of Mental Disorders, Fourth Edition (DSM-IV)"
- Parsing_Error: "3)"